Clinical trial exclusion criterion:
Patients with active autoimmune disease or a documented history of autoimmune disease or syndrome that requires systemic steroids or immunosuppressive agents. Patients with vitiligo or resolved childhood asthma/atopy would be exception to this rule. Patients that require inhaled steroids or local steroid injections would not be excluded from the study. Patients with hypothyroidism not from autoimmune disease that is stable on hormone replacement will not be excluded from the study.

Entity relations:
- Has_temporal("autoimmune disease", "active")
- Has_temporal("autoimmune disease", "history")
- AND("syndrome that requires systemic steroids", "systemic steroids")
- AND("syndrome that requires immunosuppressive agents", "immunosuppressive agents")
- Has_qualifier("childhood asthma", "resolved")
- Has_negation("autoimmune disease", "not")
- AND("hypothyroidism", "autoimmune disease")
- AND("stable on hormone replacement", "hormone replacement")
- Has_qualifier("hypothyroidism", "stable on hormone replacement")
- OR("autoimmune disease", "syndrome that requires systemic steroids", "autoimmune disease", "syndrome that requires immunosuppressive agents")
- OR("vitiligo", "atopy", "childhood asthma")